Affiliation to the French social security regime or a similar regime.

The above is a clinical trial inclusion criterion. Annotated with entity spans:
[Non-query-able: Affiliation to the French social security regime or a similar regime].